Clinical trial exclusion criterion:
Hepatitis B or C carrier status

Entity relations:
- OR("Hepatitis B carrier", "Hepatitis C carrier")